Clinical trial inclusion criterion:
4. Last (less than 3 months) HbA1c ≤ 10%.

Annotated entities:
- Parsing_Error: "4."
- Measurement: "HbA1c"
- Value: "≤ 10%"
- Temporal: "Last (less than 3 months)"